孩童時期偶發的甲狀腺腫（sporadic goiter）最常見的原因為：
A. 單純性甲狀腺腫（simple goiter）
B. 甲狀腺素合成障礙
C. 甲狀腺癌（thyroid cancer）
D. 淋巴球性甲狀腺炎（lymphocytic thyroiditis）

正確答案：D. 淋巴球性甲狀腺炎（lymphocytic thyroiditis）